Clinical trial inclusion criterion:
Currently smoke at least ten cigarettes a day

Annotated entities:
- Observation: "smoke"
- Multiplier: "at least ten cigarettes a day"